一位42歲女性病患，因右下肢腫痛多日來急診求診，經診斷是深層靜脈栓塞（deep vein thrombosis），下列何者較不可能是此疾病之危險因子？
A. 癌症病史
B. 肥胖
C. 懷孕
D. 糖尿病

正確答案：D. 糖尿病